一位 35 歲健康女性，晚上運動時，突然發生失語症，右側肢體無力，其最不可能的診斷為：
A. 腦澱粉樣血管病（cerebral amyloid angiopathy）
B. 內頸動脈剝離
C. 高安氏動脈炎（Takayasu's arteritis）
D. 動靜脈血管畸形

正確答案：A. 腦澱粉樣血管病（cerebral amyloid angiopathy）